Currently take bisphosphonates, estrogen replacement therapy, glucocorticosteroids, or other drugs affecting bone

The above is a clinical trial exclusion criterion. Annotated with entity spans:
Currently take [Drug: bisphosphonates], [Procedure: estrogen replacement therapy], [Drug: glucocorticosteroids], or other [Drug: drugs affecting bone]